What is the main focus of the CVE R/Bioconductor package?

The CVE package allows interactive variant prioritisation to expedite the analysis of cancer sequencing studies.